Clinical trial exclusion criterion:
No light perception in the affected eye

Annotated entities:
- Negation: "No"
- Condition: "light perception"